臺灣的苯酮尿症患者，大約有三分之一是由苯丙胺酸 hydroxylase 的輔tetrahydrobiopterin（BH4）缺乏所引起。BH4 同時也是 dopamine 以及 serotonin 合成所需。所以 BH4 缺乏時，除了苯丙胺酸的濃度上升之外，還會有那一項表現？
A. 酸血症
B. 因為神經傳導物質缺乏所引起之神經退化症狀
C. 容易產生嗜鉻性細胞瘤（pheochromocytoma）
D. 先天性心臟病

正確答案：B. 因為神經傳導物質缺乏所引起之神經退化症狀